用餐後血糖進入肝細胞及骨骼肌細胞轉換成肝糖（glycogen），葡萄糖以下列何種型式直接參與肝糖合成？
A. glucose 1-phosphate
B. glucose 6-phosphate
C. CMP-glucose
D. UDP-glucose

正確答案：D. UDP-glucose